Clinical trial exclusion criterion:
Use of any of the following treatments or any other alternative therapy within 2 weeks of the pre-treatment PET scan that may have beneficial effects on mood, including St John's Wort, S-adenosyl methionine (SAMe), n-3 fatty acids, or light therapy.

Annotated entities:
- Procedure: "treatments"
- Procedure: "alternative therapy"
- Temporal: "within 2 weeks of the pre-treatment PET scan"
- Reference_point: "pre-treatment PET scan"
- Condition: "mood"
- Drug: "St John's Wort"
- Drug: "S-adenosyl methionine"
- Drug: "SAMe"
- Drug: "n-3 fatty acids"
- Procedure: "light therapy"